Clinical trial exclusion criterion:
Application of preparations of immune globulin or blood transfusion within last three months prior to clinical studies;

Annotated entities:
- Drug: "preparations of immune globulin"
- Procedure: "blood transfusion"
- Temporal: "within last three months prior to clinical studies"